Clinical trial inclusion criterion:
Patients eligible for PCI with application of DES, due to ACS.

Annotated entities:
- Procedure: "PCI"
- Procedure: "DES"
- Condition: "ACS"